腦部發育過程中，下列何者不是衍生自翼板（alar plate）？
A. 橄欖核（olivary nucleus）
B. 楔核（cuneate nucleus）
C. 紅核（red nucleus）
D. 下丘（inferior colliculus）

正確答案：C. 紅核（red nucleus）